Severe distal arteriopathie > stage II of Leriche and Fontaine

The above is a clinical trial exclusion criterion. Annotated with entity spans:
[Qualifier: Severe] [Condition: distal arteriopathie] [Value: >] [Measurement: stage] II of Leriche and Fontaine